Clinical trial exclusion criterion:
Application in the last 7 days at the site of injection of local treatments (apart emollients or antiseptics) or injections of botulism toxin or dynamic phototherapy or laser in the last 6 months.

Entity relations:
- Has_negation("emollients", "apart")
- AND("Application of local treatments", "emollients")
- Has_temporal("Application of local treatments", "in the last 7 days")
- AND("injections", "botulism toxin")
- Has_temporal("injections", "in the last 6 months")
- OR("emollients", "antiseptics")
- OR("injections", "dynamic phototherapy", "laser")